靜脈注射型麻醉劑 ketamine 的主要作用機轉為何？
A. 活化GABAA受體
B. 抑制GABAA受體
C. 活化NMDA受體
D. 抑制NMDA受體

正確答案：D. 抑制NMDA受體